Clinical trial inclusion criterion:
Age >= 18

Annotated entities:
- Person: "Age"
- Value: ">= 18"